導致因血型不符所引起的輸血反應（transfusion reaction）的機制是：
A. 立即性過敏免疫反應（immediate hypersensitivity）
B. T 細胞媒介的過敏反應（T cell-mediated hypersensitivity）
C. 免疫複合體媒介的過敏反應（immune complex-mediated hypersensitivity）
D. 抗體媒介的毒殺作用（antibody-mediated cytotoxicity）

正確答案：D. 抗體媒介的毒殺作用（antibody-mediated cytotoxicity）